Clinical trial inclusion criterion:
Children undergoing ENT surgery under general anaesthesia.

Entity relations:
- Has_temporal("ENT surgery", "undergoing")
- AND("ENT surgery", "general anaesthesia")